who require mechanical ventilation, and

The above is a clinical trial inclusion criterion. Annotated with entity spans:
who require [Procedure: mechanical ventilation], and